Clinical trial inclusion criterion:
1. Justification: Many neural processes change with age, and these changes could introduce unwanted variability in both behavioral and MRI signals. In addition, the risk of difficult-to-detect medical abnormalities such as silent cerebral infarcts increases with age.

Annotated entities:
- Parsing_Error: "1."
- Parsing_Error: "Justification: Many neural processes change with age, and these changes could introduce unwanted variability in both behavioral and MRI signals."
- Not_a_criteria: "Justification: Many neural processes change with age, and these changes could introduce unwanted variability in both behavioral and MRI signals."
- Not_a_criteria: "In addition, the risk of difficult-to-detect medical abnormalities such as silent cerebral infarcts increases with age."
- Parsing_Error: "In addition, the risk of difficult-to-detect medical abnormalities such as silent cerebral infarcts increases with age."